Clinical trial exclusion criterion:
Diagnosis of peripartum- or chemotherapy-induced cardiomyopathy within the 12 months.

Annotated entities:
- Condition: "cardiomyopathy"
- Procedure: "chemotherapy"
- Qualifier: "chemotherapy-induced"
- Condition: "peripartum"
- Qualifier: "peripartum- induced"
- Temporal: "within the 12 months"